How many nucleotides long is the HOTAIR CNE?

The HOTAIR element is a 32-nucleotide conserved noncoding element